Which plant does oleuropein originate from?

Oleuropein originates from olive trees, and is specifically found in olive leaf extracts.